¿En cuál de los siguientes trastornos de ansiedad se considera que no existe un tratamiento farmacológico de elección?
1. Trastorno obsesivo-compulsivo.
2. Trastorno de pánico (trastorno de angustia).
3. Fobia social.
4. Fobia específica.
5. Trastorno de estrés postraumático.

Respuesta correcta: 4. Fobia específica.